High blood pressure diagnosed by a doctor

The above is a clinical trial exclusion criterion. Annotated with entity spans:
[Condition: High blood pressure] diagnosed by a doctor